Clinical trial inclusion criterion:
Viremia >= 3 log UI/ml

Entity relations:
- Has_value("Viremia", ">= 3 log UI/ml")